Clinical trial inclusion criterion:
Viral load < 200 copies

Annotated entities:
- Measurement: "Viral load"
- Value: "< 200 copies"